Clinical trial exclusion criterion:
Systolic blood pressure outside the range of 100-160 mmHg or diastolic blood pressure above 95 mmHg at Screening

Entity relations:
- Has_value("Systolic blood pressure", "outside the range of 100-160 mmHg")
- Has_value("diastolic blood pressure", "above 95 mmHg")
- Has_temporal("Systolic blood pressure", "at Screening")
- OR("Systolic blood pressure", "diastolic blood pressure")